Clinical trial exclusion criterion:
Significant suicide or violence risk

Annotated entities:
- Condition: "suicide risk"
- Condition: "violence risk"
- Qualifier: "Significant"